Clinical trial inclusion criterion:
At least one top quality embryo

Annotated entities:
- Value: "At least one"
- Measurement: "top quality embryo"